Clinical trial inclusion criterion:
Patients underwent percutaneous coronary intervention with drug-eluting stent;

Annotated entities:
- Procedure: "percutaneous coronary intervention"
- Device: "drug-eluting stent"